Clinical trial inclusion criterion:
Serum Cr = 1 × ULN endogenous creatinine clearance>50ml/min (Cockcroft-Gault formula)

Annotated entities:
- Measurement: "Serum Cr"
- Value: "= 1 × ULN"
- Measurement: "endogenous creatinine clearance"
- Value: ">50ml/min"